Clinical trial exclusion criterion:
congenital heart disease

Annotated entities:
- Condition: "congenital heart disease"